What is the route of administration of vaxchora?

Vaxchora is an oral vaccine.